孕婦不可使用下列抗生素的原因，下列何者正確？
A. erythromycin estolate易使胎兒第八對腦神經受損
B. streptomycin易導致嬰兒軟骨受損
C. sulfonamides易導致缺乏glucose-6-phosphate dehydrogenase之新生兒溶血作用而引起核黃疸
D. tetracycline會導致灰嬰症候群（gray baby syndrome）

正確答案：C. sulfonamides易導致缺乏glucose-6-phosphate dehydrogenase之新生兒溶血作用而引起核黃疸